stroke or other cardioembolic event within the 30 days prior to the scheduled procedure;

The above is a clinical trial exclusion criterion. Annotated with entity spans:
[Condition: stroke] or [Qualifier: other] [Condition: cardioembolic event] [Temporal: within the 30 days prior to the scheduled procedure];